在研究細菌 DNA 複製過程中，5'-bromouracil 常用來取代 thymidine 的藥品，其原因為何？
A. 導致 DNA 合成的終止
B. 容易在 DNA 上產生切割位置
C. 可以產生較重的 DNA，且易於用離心方式分離
D. 可以用來染色 DNA

正確答案：C. 可以產生較重的 DNA，且易於用離心方式分離